Patient with known liver disease or renal disease

The above is a clinical trial exclusion criterion. Annotated with entity spans:
Patient with known [Condition: liver disease] or [Condition: renal disease]